對急性心肌梗塞的病人進行血栓溶解劑治療（thrombolytic therapy）時，下列敘述何者最不正確？
A. 治療的黃金時間是在急性心肌梗塞發作後 6 小時內給予
B. 治療最常見的副作用是出血
C. 梗塞相關冠狀動脈（infarct related artery）之血流經血栓溶解治療後，若是 TIMI grade 1 者，其預後較 TIMI grade 3 者為佳
D. 合併嚴重的高血壓（收縮壓大於 180 mmHg）者，是施行血栓溶解劑治療的禁忌症

正確答案：C. 梗塞相關冠狀動脈（infarct related artery）之血流經血栓溶解治療後，若是 TIMI grade 1 者，其預後較 TIMI grade 3 者為佳